Clinical trial inclusion criterion:
Has a HLA-B27+ gene and 2 or more of the SpA characteristics listed above

Annotated entities:
- Condition: "HLA-B27+"
- Condition: "SpA"
- Multiplier: "2 or more"